¿Qué información se tiene que recabar para elaborar el análisis topográfico de la conducta agresiva en la infancia?:
1. Resistencia de la conducta agresiva.
2. Relación entre los antecedentes y consecuentes de la conducta agresiva.
3. Frecuencia, intensidad, duración de la conducta agresiva.
4. Historia de la conducta agresiva.

Respuesta correcta: 3. Frecuencia, intensidad, duración de la conducta agresiva.